What is the role of the IRE1a-XBP1 pathway?

The inositol-requiring enzyme 1a (IRE1a)/X-box binding protein 1 (XBP1) pathway plays crucial roles in cell survival and cell death by upregulating UPR-associated genes involved in protein entry into the endoplasmic reticulum  and ER-associated degradation (ERAD).